下列那一種中耳腔之腫瘤以耳膜後紅色或暗紅色腫塊呈現？
A. 頸靜脈球瘤（glomus jugulare tumor）
B. 中耳膽脂瘤（cholesteatoma）
C. 脂肪瘤（lipoma）
D. 骨瘤（osteoma）

正確答案：A. 頸靜脈球瘤（glomus jugulare tumor）